妊娠期肝內膽汁淤積症（intrahepatic cholestasis of pregnancy, ICP）導致胎兒不良結局，最主要因素為：
A. 孕婦血清膽酸 （bile acids）
B. 孕婦血清直接膽紅素（direct bilirubin）
C. 孕婦血清膽固醇 （cholesterol）
D. 孕婦血清穀草轉氨酶（AST）

正確答案：A. 孕婦血清膽酸 （bile acids）